Clinical trial exclusion criterion:
Contraindication to Filgrastim

Annotated entities:
- Condition: "Contraindication"
- Drug: "Filgrastim"